Clinical trial inclusion criterion:
Body weight greater than 33.4 kg and a healthy weight using age-based body mass index (BMI) range 5th-85th percentile at screening and baseline. Appendix 3 contains BMI-for-age charts that can be consulted.

Entity relations:
- Has_value("Body weight", "greater than 33.4 kg")
- Subsumes("body mass index", "BMI")
- Has_value("body mass index", "5th-85th percentile")